Clinical trial exclusion criterion:
Pregnant or breastfeeding

Annotated entities:
- Observation: "Pregnant"
- Observation: "breastfeeding"